6. Ischemic heart failure without the revascularization or undergone the revascularization within last 6 months;

The above is a clinical trial exclusion criterion. Annotated with entity spans:
6. [Condition: Ischemic heart failure] [Negation: without] the [Procedure: revascularization] or undergone the [Procedure: revascularization] [Temporal: within last 6 months];